Past or present hepatitis B infection (positive hepatitis B serology)

The above is a clinical trial exclusion criterion. Annotated with entity spans:
Past or present [Condition: hepatitis B infection] ([Value: positive] [Measurement: hepatitis B serology])